Inpatient status, airway abnormalities, allergy to any study medications, eggs and soy, and mitochondrial disorders.

The above is a clinical trial exclusion criterion. Annotated with entity spans:
[Observation: Inpatient status], [Condition: airway abnormalities], [Condition: allergy] to any [Drug: study medications], [Drug: eggs] and [Drug: soy], and [Condition: mitochondrial disorders].